下列何者為龜頭（glans）的主要支配神經？
A. 股後皮神經
B. 生殖股神經
C. 陰莖背側神經
D. 髂腹股溝神經

正確答案：C. 陰莖背側神經